張醫師在臨床上照顧到一個很有趣的攝護腺癌病例，他想進一步進行病例對照研究以了解該類似的攝護腺癌症相關表現。張醫師將相關想法與病理科林醫師討論，並進一步寫成研究計畫，也經過研究倫理委員會審核通過。當張醫師打算著手進行研究時，病理科林醫師委婉地告訴張醫師，只要用到病理科的病理檢體，不論該研究結果為何，病理科王主任都要求將來的論文，通訊作者一定要掛名王主任，即使王主任在整個研究計畫中完全沒有參與。關於王主任這樣的要求，下列敘述何者最適當？
A. 病理科王主任的要求合理。因為相關病理檢體來自於病理科，王主任要求掛名通訊作者符合研究倫理規範
B. 病理科王主任的要求合理。因為張醫師既然要與病理科合作，病理科王主任要求掛名通訊作者符合研究倫理規範
C. 病理科王主任的要求不合理。因為王主任在整個研究計畫中完全沒有參與
D. 病理科王主任的要求不合理。因為王主任已經多年沒有著作發表了，掛名通訊作者對於論文的發表沒有任何助益

正確答案：C. 病理科王主任的要求不合理。因為王主任在整個研究計畫中完全沒有參與